Clinical trial inclusion criteria:
Informed consent as documented by signature (see informed consent form)
Primary ITP according to the definition of Rodeghiero et al. (52) and a platelet count of <30x109/l
Age range: 18-45 years
Previously treated patients, with failure or intolerance to first-line therapy, or relapse after first-line therapy, i.e. corticosteroids, intravenous immunoglobulin (IVIG), or anti-D immunoglobulins

Annotated entities:
- Post-eligibility: "Informed consent as documented by signature (see informed consent form)"
- Condition: "Primary ITP"
- Measurement: "definition of Rodeghiero"
- Measurement: "platelet count"
- Value: "<30x109/l"
- Person: "Age"
- Value: "18-45 years"
- Observation: "Previously treated"
- Procedure: "first-line therapy"
- Qualifier: "failure"
- Qualifier: "intolerance"
- Condition: "relapse"
- Temporal: "after first-line therapy"
- Reference_point: "first-line therapy"
- Procedure: "first-line therapy"
- Drug: "corticosteroids"
- Drug: "intravenous immunoglobulin"
- Drug: "anti-D immunoglobulins"
- Drug: "IVIG"